Low back pain of less than six weeks' duration; and at least moderate pain intensity (NRS<U+2267>4)

The above is a clinical trial inclusion criterion. Annotated with entity spans:
[Condition: Low back pain] of [Temporal: less than six weeks' duration]; and [Value: at least moderate] [Measurement: pain intensity] ([Measurement: NRS]<U+2267>[Value: 4])